Clinical trial exclusion criterion:
Participants with prostate specific antigen (PSA) > 3.0 ng/mL (or 1.5 if on 5-alpha reductase inhibitors)

Annotated entities:
- Measurement: "prostate specific antigen (PSA)"
- Value: "> 3.0 ng/mL"
- Drug: "5-alpha reductase inhibitors"
- Value: "1.5"